Clinical trial exclusion criterion:
Has a neuromuscular disorder that may affect NMB and/or trial assessments.

Entity relations:
- Has_context("neuromuscular disorder", "affect NMB")
- OR("affect NMB", "affect trial assessments")